Clinical trial exclusion criterion:
Clinically significant illness during the 4 weeks prior to the first dose administration

Annotated entities:
- Temporal: "during the 4 weeks prior to the first dose administration"
- Reference_point: "the first dose administration"
- Condition: "illness"
- Qualifier: "Clinically significant"
- Subjective_judgement: "Clinically significant illness during the 4 weeks prior to the first dose administration"